Clinical trial inclusion criterion:
Age: 10-18 years.

Annotated entities:
- Person: "Age"
- Value: "10-18 years"